Written informed consent

The above is a clinical trial inclusion criterion. Annotated with entity spans:
[Observation: Written informed consent]